Which bacterium has the smallest genome in base pairs yet found?

sequenced genomes of the obligate symbionts , sulcia muelleri and nasuia deltocephalinicola , of the phloem-feeding pest insect , macrosteles quadrilineatus (auchenorrhyncha: cicadellidae). . regions exhibit a significant reduction in length and gene number in b aphidicola bcc , as it could be expected since it possess the smallest bacterial genome. . results reveal that nasuia-alf has the smallest bacterial genome yet sequenced (112 kb) , and that the sulcia-alf genome (190 kb) is smaller than that of sulcia in other insect lineages. .